Clinical trial exclusion criterion:
Apnea-hypopnea index of less than 5 h-1 or greater than 30 h-1.

Entity relations:
- Has_value("Apnea-hypopnea index", "less than 5 h-1 or greater than 30 h-1")